一位 31 歲男性因持續 2 天腹痛而求診，他有高血壓、糖尿病及高血脂的病史，半年前曾發生過一次急性胰臟炎，在急診室的檢查結果發現 BUN 18 mg/dL，creatinine 1.1 mg/dL，glucose 323 mg/dL， CRP（c-reactive protein）0.47 mg/L，amylase 84 U/L，lipase 390 U/L，最可能的診斷為何？
A. 急性胰臟炎（acute pancreatitis）
B. 酮酸血症（ketoacidosis）
C. 急性心肌梗塞（acute myocardial infarction）
D. 十二指腸潰瘍（duodenal ulcer）

正確答案：A. 急性胰臟炎（acute pancreatitis）